Clinical trial inclusion criterion:
Informed consent as documented by signature

Annotated entities:
- Informed_consent: "nformed consent as documented by signature"